Clinical trial exclusion criterion:
patients allergic to misoprostol;

Entity relations:
- AND("allergic", "misoprostol")